Clinical trial exclusion criterion:
High bleeding risk or spontaneously prolonged prothrombin time or activated partial thromboplastin time > 1.5 x ULN

Entity relations:
- Has_qualifier("prolonged prothrombin time", "spontaneously")
- Has_value("activated partial thromboplastin time", "> 1.5 x ULN")
- OR("High bleeding risk", "prolonged prothrombin time", "activated partial thromboplastin time")